Clinical trial exclusion criterion:
Gastrointestinal bleeding in the previous 3 months.

Entity relations:
- Has_temporal("Gastrointestinal bleeding", "in the previous 3 months")